Clinical trial inclusion criterion:
conform to the indications of hepatectomy;

Annotated entities:
- Procedure: "hepatectomy"
- Observation: "indications of hepatectomy"